Clinical trial exclusion criterion:
patients without health insurance,

Entity relations:
- Has_negation("health insurance", "without")